Subjects with a history of small bowel or colonic resection.

The above is a clinical trial exclusion criterion. Annotated with entity spans:
Subjects with a [Temporal: history] of [Condition: small bowel] or [Condition: colonic resection].